Free from chronic disease e.g. malignancy requiring frequent medical attention (as from the Ante-natal card)

The above is a clinical trial inclusion criterion. Annotated with entity spans:
Free from [Condition: chronic disease] e.g. [Condition: malignancy] requiring frequent medical attention (as from the Ante-natal card)